15. Any other condition(s) that would compromise the safety of the subject or compromise the quality of the clinical study, as judged by the Investigator

The above is a clinical trial exclusion criterion. Annotated with entity spans:
[Parsing_Error: 15.] [Non-query-able: Any other condition(s) that would compromise the safety of the subject or compromise the quality of the clinical study, as judged by the Investigator]